Clinical trial inclusion criterion:
Patients undergoing surgery with general anesthesia,

Entity relations:
- Has_temporal("surgery", "undergoing")
- Has_qualifier("surgery", "general anesthesia")
- multi("general anesthesia", "general anesthesia")